Clinical trial exclusion criterion:
6. Currently taking other medications thought to have an impact on immune system functioning, i.e., chemotherapeutic agents.

Entity relations:
- Has_qualifier("medications", "other")
- Has_qualifier("medications", "impact on immune system functioning")
- Subsumes("medications", "chemotherapeutic agents")
- Has_temporal("medications", "Currently")